Clinical trial exclusion criterion:
Renal disease that needs dialysis

Annotated entities:
- Condition: "Renal disease"
- Mood: "needs"
- Procedure: "dialysis"